Ulcers due to non-diabetic etiology.

The above is a clinical trial exclusion criterion. Annotated with entity spans:
[Condition: Ulcers] due to [Qualifier: non-diabetic] etiology.